Ingresa en nuestra planta desde Urgencias para estudio un paciente de 80 años refiriendo pérdida de peso y malestar inespecífico centroabdominal, junto a pérdida de apetito. El proceso diagnóstico que debemos desarrollar durante su ingreso será guiado por los siguientes principios EXCEPTO:
1. Se realizarán todas aquellas pruebas que puedan aportar luz al proceso sospechado por el médico cubriendo el más amplio diagnóstico diferencial desde el comienzo.
2. El proceso asistencial se adaptará al contexto clínico individual del paciente y se buscará que éste sea partícipe de las decisiones relativas al diagnóstico y tratamiento.
3. Es importante pensar en primer lugar en lo más corriente, para sólo después, una vez descartadas con certeza las entidades más frecuentes, considerar lo raro.
4. Algunas pruebas complementarias pueden ser redundantes y no aportar valor al proceso diagnóstico, pero si al coste sanitario. Así, ante dos pruebas complementarias de rendimiento similar, se decidirá siempre por la más económica y de menor riesgo.
5. Es imprescindible que el médico no añada nuevas incomodidades con la práctica de exploraciones complementarias que no sean estrictamente necesarias.

Respuesta correcta: 1. Se realizarán todas aquellas pruebas que puedan aportar luz al proceso sospechado por el médico cubriendo el más amplio diagnóstico diferencial desde el comienzo.